一位 45 歲女性患者冬天在密閉且設有熱水器之浴室洗澡，因意識不清疑有CO中毒而被送至急診，在 吸入室內空氣時之動脈血液氣體分析結果顯示pH 7.32，PaCO2 38 mmHg，PaO2 86 mmHg，HCO3- 20 mEq/L，BEECF- 4 mEq/L，SaO2 98%。請問下列之處理，何者最為正確？
A. PaO2為 86 mmHg，故氧氣治療並不需要
B. 先給予高濃度之氧氣治療，並抽血送 carboxyhemoglobin 之檢查
C. 動脈血液氣體分析結果SaO2為 98%，故carboxyhemoglobin量很少，排除CO中毒之診斷
D. 給予 sodium bicarbonate，來治療代謝性酸中毒

正確答案：B. 先給予高濃度之氧氣治療，並抽血送 carboxyhemoglobin 之檢查